Clinical trial exclusion criterion:
Hepatitis B or C infection

Annotated entities:
- Condition: "Hepatitis B"
- Condition: "Hepatitis C"